Require no red blood cell transfusion or dependent on <4 units within 8 weeks prior to screening

The above is a clinical trial inclusion criterion. Annotated with entity spans:
Require [Negation: no] [Procedure: red blood cell transfusion] or dependent on [Multiplier: <4 units] [Temporal: within 8 weeks prior to screening]